Clinical trial inclusion criterion:
plaque burden>70%

Annotated entities:
- Measurement: "plaque burden"
- Value: ">70%"